嬰兒開始站立行走後，下列何者最為明顯？
A. 頸彎曲
B. 胸彎曲
C. 腰彎曲
D. 薦彎曲

正確答案：C. 腰彎曲